Clinical trial inclusion criterion:
age 18-65 years

Annotated entities:
- Person: "age"
- Value: "18-65 years"